irritable bowel, unexplained intermittent vomiting, severe abdominal pain, chronic diarrhea or constipation

The above is a clinical trial exclusion criterion. Annotated with entity spans:
[Condition: irritable bowel], unexplained [Qualifier: intermittent] [Condition: vomiting], [Qualifier: severe] [Condition: abdominal pain], [Qualifier: chronic] [Condition: diarrhea] or [Condition: constipation]